Clinical trial exclusion criteria:
dual organ transplant

Annotated entities:
- Multiplier: "dual"
- Procedure: "organ transplant"